Clinical trial exclusion criterion:
Weight <50 kg

Entity relations:
- Has_value("Weight", "<50 kg")